Subjects on fetal hemoglobin inducing agents

The above is a clinical trial exclusion criterion. Annotated with entity spans:
Subjects on [Drug: fetal hemoglobin inducing agents]